Adults patients aged 18 to 85 years

The above is a clinical trial inclusion criterion. Annotated with entity spans:
[Person: Adults] patients [Person: aged] [Value: 18 to 85 years]